妊娠性滋養層疾病（Gestational trophoblastic disease）若無轉移，則最常用的治療方法為：
A. 子宮全切除
B. 骨盆腔放射線治療
C. methotrexate 或 actinomycin-D
D. cisplatin 或 taxol

正確答案：C. methotrexate 或 actinomycin-D